下列何種藥物，最不可能縮小子宮肌瘤？
A. RU486
B. 黃體素（progesterone）
C. GnRH
D. GnRH 拮抗劑

正確答案：B. 黃體素（progesterone）